Clinical trial exclusion criterion:
Severe left ventricular hypertrophy (left ventricular septal wall thickness > 13mm)

Entity relations:
- Has_qualifier("left ventricular hypertrophy", "Severe")
- Subsumes("left ventricular hypertrophy", "left ventricular septal wall thickness")
- OR("left ventricular septal wall thickness", "> 13mm")